Clinical trial exclusion criterion:
a history of non-standard treatment(chemotherapy or surgery)

Entity relations:
- Subsumes("non-standard treatment", "chemotherapy")
- OR("chemotherapy", "surgery")